Clinical trial exclusion criterion:
5. The ulcer has > 50% slough, significant necrotic tissue, bone, tendon, or capsule exposure or avascular ulcer beds

Annotated entities:
- Parsing_Error: "5."
- Measurement: "slough"
- Value: "> 50%"
- Condition: "ulcer"
- Observation: "necrotic tissue"
- Observation: "bone exposure"
- Observation: "capsule exposure"
- Observation: "tendon exposure"
- Observation: "avascular ulcer beds"